Clinical trial exclusion criterion:
preexisting CNS depression, or taking regularly medication that cause CNS depression

Entity relations:
- AND("CNS depression", "medication")
- OR("CNS depression", "CNS depression")